Clinical trial exclusion criterion:
Current or past psychosis

Entity relations:
- Has_temporal("psychosis", "Current")
- OR("Current", "past")